Clinical trial inclusion criterion:
Reference vessel diameter 2.75-4.0

Annotated entities:
- Measurement: "Reference vessel diameter"
- Value: "2.75-4.0"